糞腸球菌（Enterococcus faecalis）最有可能引發下列那種疾病？
A. 肺炎（pneumonia）
B. 腦膜炎（meningitis）
C. 食物中毒（food poisoning）
D. 泌尿道感染（urinary tract infection）

正確答案：D. 泌尿道感染（urinary tract infection）